Congenital or organic bowel pathology

The above is a clinical trial exclusion criterion. Annotated with entity spans:
[Condition: Congenital] or [Condition: organic bowel pathology]